Clinical trial exclusion criterion:
alemtuzumab,

Annotated entities:
- Drug: "alemtuzumab"